Fulfillment of the Diagnostic and Statistical Manual of Mental Disorders, Fourth Edition, (DSM-IV) diagnostic criteria for ADHD

The above is a clinical trial inclusion criterion. Annotated with entity spans:
Fulfillment of the [Qualifier: Diagnostic and Statistical Manual of Mental Disorders, Fourth Edition, (DSM-IV) diagnostic criteria] for [Condition: ADHD]